Clinical trial exclusion criterion:
Urinary cotinine levels indicative of smoking or history or regular use of tobacco- or nicotine-containing products within 6 months prior to screening.

Entity relations:
- Has_temporal("regular use of tobacco", "history")
- AND("smoking", "Urinary cotinine levels")
- Has_index("within 6 months prior to screening", "screening")
- Has_temporal("regular use of nicotine-containing products", "history")
- Has_temporal("cotinine", "within 6 months prior to screening")
- Has_temporal("smoking", "within 6 months prior to screening")
- OR("smoking", "regular use of tobacco", "regular use of nicotine-containing products")